Clinical trial exclusion criterion:
Presence of clinically significant (grade 2-4) anterior segment abnormalities

Entity relations:
- Has_value("grade 2-4", "2-4")
- Subsumes("clinically significant", "grade 2-4")
- Has_qualifier("anterior segment abnormalities", "clinically significant")